病人因腦膿瘍顱內壓上升而發生經天幕腦脫疝（transtentorial herniation）時，會壓迫到那一條血管而造成局部缺血？
A. 前大腦動脈
B. 中大腦動脈
C. 後大腦動脈
D. 基底動脈

正確答案：C. 後大腦動脈